Patients with sepsis or active infection.

The above is a clinical trial exclusion criterion. Annotated with entity spans:
Patients with [Condition: sepsis] or [Condition: active infection].